on a sodium-restricted diet

The above is a clinical trial exclusion criterion. Annotated with entity spans:
on a [Procedure: sodium-restricted diet]